Clinical trial exclusion criterion:
Surgical treatment history (except anti-reflux treatment) or esophageal radiotherapy,

Entity relations:
- Has_temporal("Surgical treatment", "history")
- Has_negation("anti-reflux treatment", "except")
- AND("Surgical treatment", "anti-reflux treatment")
- OR("Surgical treatment", "esophageal radiotherapy")